中年男性病人，主訴倦怠、上腹痛、噁心、嘔吐及發燒兩週住院，血清檢驗 IHA（indirect hemagglutination）1：512。鑑別診斷中首要考慮的疾病為：
A. 愛滋病
B. 胰臟癌
C. 阿米巴肝膿瘍
D. 肝結核

正確答案：C. 阿米巴肝膿瘍